AZT（3'-azido-2',3'-dideoxythymidine）可用以治療human immunodeficiency virus（HIV）的感染，其作用是：
A. 病毒蛋白質水解酶（protease）的抑制劑
B. DNA polymerase的競爭性抑制劑
C. 反轉錄酵素（reverse transcriptase）合成DNA鏈的終止者
D. RNase H的抑制劑

正確答案：C. 反轉錄酵素（reverse transcriptase）合成DNA鏈的終止者